Clinical trial inclusion criterion:
Hyperglycemia (Serum glucose > 200 mg/dl)

Annotated entities:
- Condition: "Hyperglycemia"
- Measurement: "Serum glucose"
- Value: "> 200 mg/dl"